Clinical trial exclusion criterion:
Use of any investigational or non-registered product (drug or vaccine) other than the study vaccine(s) within 30 days prior to the first vaccination, or planned use during the study period.

Entity relations:
- Has_qualifier("product", "investigational")
- Subsumes("product", "drug")
- Has_negation("study vaccine(s)", "other than")
- Has_qualifier("product", "other than the study vaccine(s)")
- multi("other than the study vaccine(s)", "study vaccine(s)")
- Has_temporal("product", "within 30 days prior to the first vaccination")
- Has_temporal("vaccination", "first")
- multi("the first vaccination", "vaccination")
- Has_index("within 30 days prior to the first vaccination", "the first vaccination")
- Has_mood("use", "planned")
- Has_temporal("use", "during the study period")
- AND("product", "use")
- OR("investigational", "non-registered")
- OR("drug", "vaccine")